Clinical trial inclusion criterion:
• Good response to nonsteroidal anti-inflammatory drugs (NSAID)

Entity relations:
- AND("Good response", "nonsteroidal anti-inflammatory drugs (NSAID)")